Clinical trial inclusion criterion:
Three or more failed trials of pharmacotherapy for the current GAD episode

Annotated entities:
- Multiplier: "Three or more"
- Procedure: "trials of pharmacotherapy"
- Qualifier: "failed"
- Condition: "GAD episode"
- Temporal: "current"